Clinical trial exclusion criterion:
current substance use disorder

Entity relations:
- Has_temporal("substance use disorder", "current")